下列有關不孕症的敘述，何者錯誤？
A. infertility 是指夫妻（或同居男女）在沒有避孕而有正常性生活的情況下經過一年而仍未懷孕
B. 婦女在 30 歲以後年齡愈大愈不容易懷孕
C. 高齡婦女較不易懷孕的因素中，卵子品質的影響大於子宮內膜
D. 高齡婦女之生育力較差與流產無關

正確答案：D. 高齡婦女之生育力較差與流產無關